下列何者不是脂蛋白分解酵素（lipoprotein lipase）缺乏症之典型臨床表現？
A. 發疹性黃色瘤（eruptive xanthomas）
B. 胰臟炎
C. 動脈硬化
D. 三酸甘油酯過高

正確答案：C. 動脈硬化